Clinical trial inclusion criteria:
Outpatient with primary DSM- IV OCD
Completion of a 14-week open label trial of one the following SRI's: fluoxetine 80 mg/day, paroxetine 60 mg/day, fluvoxamine 300 mg/day, clomipramine 250 mg/day, sertraline 200 mg/day, citalopram 60 mg/day, escitalopram 30 mg/day and demonstrating a non or partial responses to SRI treatment (CGI-I of 3 or 4, Y-BOCS reduction of < 35%)
Stable (8 wks or longer) concurrent medications including benzodiazepines, sedative hypnotics, antipsychotics, and antidepressants.

Annotated entities:
- Condition: "OCD"
- Qualifier: "primary"
- Qualifier: "DSM- IV"
- Visit: "Outpatient"
- Multiplier: "14-week"
- Drug: "fluoxetine"
- Multiplier: "80 mg/day"
- Drug: "paroxetine"
- Multiplier: "60 mg/day"
- Drug: "fluvoxamine"
- Multiplier: "300 mg/day"
- Drug: "clomipramine"
- Multiplier: "250 mg/day"
- Drug: "sertraline"
- Multiplier: "200 mg/day"
- Drug: "citalopram"
- Multiplier: "60 mg/day"
- Drug: "escitalopram"
- Multiplier: "30 mg/day"
- Condition: "responses to"
- Measurement: "CGI-I"
- Value: "3"
- Value: "4"
- Measurement: "Y-BOCS"
- Value: "reduction of < 35%"
- Multiplier: "one the following"
- Procedure: "SRI treatment"
- Drug: "medications"
- Qualifier: "concurrent"
- Qualifier: "Stable"
- Temporal: "8 wks or longer"
- Drug: "benzodiazepines"
- Drug: "sedative hypnotics"
- Drug: "antipsychotics"
- Drug: "antidepressants"